Concurrent severe medical problems unrelated to the malignancy which would limit full compliance with the study.

The above is a clinical trial exclusion criterion. Annotated with entity spans:
[Temporal: Concurrent] [Qualifier: severe] [Condition: medical problems] [Qualifier: unrelated to the malignancy] which would [Qualifier: limit full compliance with the study].